Glecaprevir and Pibrentasvir are used for tratment of which disease?

The combination of direct-acting antivirals glecaprevir and pibrentasvir is effective for treatment of Hepatitis C virus infection.